Clinical trial exclusion criterion:
Has been diagnosed with Glucose-6-phosphate dehydrogenase deficiency or methemoglobin reductase deficiency

Annotated entities:
- Condition: "Glucose-6-phosphate dehydrogenase deficiency"
- Condition: "methemoglobin reductase deficiency"